Clinical trial inclusion criterion:
Child-Pugh grade in A-level;

Annotated entities:
- Measurement: "Child-Pugh grade"
- Value: "A"